Clinical trial exclusion criterion:
No positive HIV 1 or HIV 2 test at screening

Entity relations:
- multi("at screening", "screening")
- Has_value("HIV 1 test", "positive")
- Has_temporal("HIV 1 test", "at screening")
- OR("HIV 1 test", "HIV 2 test")